Patients on longstanding NSAID therapy

The above is a clinical trial exclusion criterion. Annotated with entity spans:
Patients on [Temporal: longstanding] [Procedure: NSAID therapy]